Clinical trial exclusion criterion:
NSAID use within the past 48 hours

Annotated entities:
- Drug: "NSAID"
- Temporal: "within the past 48 hours"